Clinical trial exclusion criterion:
Pregnancy or women currently breastfeeding.

Entity relations:
- OR("Pregnancy", "breastfeeding")